Clinical trial exclusion criterion:
vaginal and urinary infection

Annotated entities:
- Condition: "urinary infection"
- Grammar_Error: "and"
- Condition: "infection vaginal"